Clinical trial inclusion criteria:
Between the ages of 21-60
Right-handed
Capable of giving informed consent and complying with study procedures
Reports drinking a minimum of 5 standard drinks for men or 4 standard drinks for women on at least 4 days per week on average over the past 28 days
Meets DSM-V criteria for current Alcohol Use Disorder
Seeking treatment for Alcohol Use Disorder
Agree to not seek additional treatment, apart from Alcoholics Anonymous
Willing to attempt to abstain from alcohol completely for the duration of the study
Willing to be hospitalized on a research unit for 24 hours, longer if detoxification is needed.

Annotated entities:
- Person: "ages"
- Value: "Between 21-60"
- Condition: "Right-handed"
- Non-query-able: "Capable of giving informed consent and complying with study procedures"
- Value: "minimum of 5 standard drinks on at least 4 days per week"
- Measurement: "drinking"
- Person: "men"
- Value: "4 standard drinks on at least 4 days per week"
- Person: "women"
- Temporal: "over the past 28 days"
- Measurement: "DSM-V criteria"
- Value: "Meets"
- Condition: "Alcohol Use Disorder"
- Condition: "Alcohol Use Disorder"
- Procedure: "treatment"
- Mood: "Seeking"
- Non-representable: "Agree to not seek additional treatment, apart from Alcoholics Anonymous"
- Mood: "Willing"
- Condition: "abstain from alcohol"
- Qualifier: "completely"
- Post-eligibility: "Willing to be hospitalized on a research unit for 24 hours, longer if detoxification is needed"